Clinical trial exclusion criterion:
Pain at rest or critical limb ischemia

Annotated entities:
- Condition: "Pain at rest"
- Condition: "critical limb ischemia"